La principal función del cerebelo es:
1. Coordinar movimientos musculares complejos.
2. Coordinar respuestas endocrinas y nerviosas.
3. Controlar la digestión, circulación y respiración.
4. Controlar el ciclo vigilia-sueño.
5. Controlar la ingesta.

Respuesta correcta: 1. Coordinar movimientos musculares complejos.